Clinical trial exclusion criterion:
Any history of brain metastases or any other active central nervous system (CNS) disease

Entity relations:
- Has_temporal("any other central nervous system (CNS) disease", "active")
- AND("history of", "brain metastases")
- OR("brain metastases", "any other central nervous system (CNS) disease")